Clinical trial exclusion criterion:
HCV co-infection

Annotated entities:
- Condition: "co-infection"
- Qualifier: "HCV"